Clinical trial exclusion criterion:
H. pylori infection

Annotated entities:
- Condition: "H. pylori infection"